何者不是安胎藥「硫酸鎂」之副作用？
A. 肺部水腫（Pulmonary edema）
B. 呼吸抑制（Respiratory depression）
C. 低血壓（Hypotension）
D. 血糖過高（Hyperglycemia）

正確答案：D. 血糖過高（Hyperglycemia）